Con carácter general, y de acuerdo con la legislación estatal sobre oficinas de farmacia, el módulo de población mínimo para la apertura de estos establecimientos es de:
1. 2.500 habitantes por establecimiento.
2. 1.000 habitantes por establecimiento.
3. 1.500 habitantes por establecimiento.
4. 2.000 habitantes por establecimiento.
5. 2.800 habitantes por establecimiento.

Respuesta correcta: 5. 2.800 habitantes por establecimiento.